全民健保目前除依醫療院所層級收取不同部分負擔外，對下列那些門診費用未加重部分負擔？
A. 復健之簡單與中度治療
B. 慢性病連續處方之藥費
C. 中醫之傷科治療
D. 一定金額以上之藥品費用

正確答案：B. 慢性病連續處方之藥費